用拳頭擊壁（拳擊手骨折），骨折常發生在那一根手指的掌骨？
A. 食指
B. 中指
C. 拇指
D. 小指

正確答案：D. 小指